Clinical trial exclusion criterion:
hypertrophic cardiomyopathy

Annotated entities:
- Condition: "hypertrophic cardiomyopathy"